Born, raised and currently living at low altitude (<800m).

The above is a clinical trial inclusion criterion. Annotated with entity spans:
Born, raised and currently [Observation: living at low altitude] (<800m).